Clinical trial exclusion criteria:
1. Need for combined organ transplantation with an extra-renal organ and/or islet cell transplant.
2. Recipients of previous non-renal solid organ and/or islet cell transplantation.
3. Infection with HIV.
4. Inability or unwillingness of a participant and/or guardian to provide informed consent

Annotated entities:
- Procedure: "combined organ transplantation"
- Qualifier: "extra-renal organ"
- Procedure: "islet cell transplant"
- Procedure: "non-renal solid organ transplantation"
- Procedure: "islet cell transplantation"
- Temporal: "previous"
- Condition: "Infection with HIV"
- Non-query-able: "Inability or unwillingness of a participant and/or guardian to provide informed consent"
- Post-eligibility: "Inability or unwillingness of a participant and/or guardian to provide informed consent"